Before participate in the study, patients must understand the treatment plan and willing to participate in the study. Patients must have signed an approved informed consent.

The above is a clinical trial inclusion criterion. Annotated with entity spans:
[Post-eligibility: Before participate in the study, patients must understand the treatment plan and willing to participate in the study. Patients must have signed an approved informed consent.]